一位 33 歲男性因早上無法起床被送至急診處。病人過去無特殊病史，半年前發現血壓偏高，但他並不在意且沒服藥物。身體診查：脈搏每分鐘 98 下，血壓 178/110 mmHg，無貧血或黃疸，胸腔、心臟和腹部檢查正常。血液電解質（mmol/L）：Na+ 139，K+ 2.5，Cl- 89。有關於此病人進一步的診斷和處置，下列何者最不適切？
A. 檢查尿液的鉀離子濃度和滲透壓，以及血清滲透壓
B. 檢查甲狀腺功能
C. 檢查血漿皮質醛固酮（aldosterone）濃度
D. 心臟超音波檢查

正確答案：D. 心臟超音波檢查